HER-2 belongs to what family of proteins?

HER-2 belongs to the human epidermal growth factor receptor family, which is a family of proteins that also includes EGF, EGF1, HER2, HER3, HER4, HER5, HER6, HER7, and HER8.